遺傳密碼（codon）與反密碼（anticodon）的相互作用是經由那一種化學鍵來進行？
A. 氫鍵（hydrogen bond）
B. 離子鍵（ionic bond）
C. 肽鍵（peptide bond）
D. 縮醛鍵（acetal bond）

正確答案：A. 氫鍵（hydrogen bond）